Clinical trial exclusion criterion:
birth asphyxia

Annotated entities:
- Condition: "birth asphyxia"